病原菌吸附在腸胃道黏膜後，其抗原可被那一種免疫細胞所攝入，並將抗原由細胞頂面（apical face）傳到底側面（basolateral face）？
A. B 淋巴球（B lymphocytes）
B. M 細胞（microfold cells）
C. 自然殺手細胞（natural killer cells）
D. T 淋巴球（T lymphocytes）

正確答案：B. M 細胞（microfold cells）